Concomitant use of potent CYP3A4 inhibitors (atazanavir, clarithromycin, indinavir, itraconazole, ketoconazole, nefazodone, nelfinavir, ritonavir, saquinavir, telithromycin and voriconazole) or inducers (carbamazepine, dexamethasone, phenobarbital, phenytoin, rifampin, and rifapentine)

The above is a clinical trial inclusion criterion. Annotated with entity spans:
[Temporal: Concomitant] use of [Drug: potent CYP3A4 inhibitors] ([Drug: atazanavir], [Drug: clarithromycin], [Drug: indinavir], [Drug: itraconazole], [Drug: ketoconazole], [Drug: nefazodone], [Drug: nelfinavir], [Drug: ritonavir], [Drug: saquinavir], [Drug: telithromycin] and [Drug: voriconazole]) or inducers ([Drug: carbamazepine], [Drug: dexamethasone], [Drug: phenobarbital], [Drug: phenytoin], [Drug: rifampin], and [Drug: rifapentine])